Clinical trial exclusion criterion:
History of myocardial infarction, unstable angina pectoris, coronary bypass surgery, or any percutaneous coronary intervention (PCI) during the 6 months prior to Visit 1

Annotated entities:
- Condition: "myocardial infarction"
- Condition: "unstable angina pectoris"
- Condition: "coronary bypass surgery"
- Condition: "percutaneous coronary intervention (PCI)"
- Temporal: "during the 6 months prior"
- Temporal: "History"